Streptococcus sobrinus y Streptococcus mutants son responsables de:
1. Caries dentales.
2. Infecciones de quemaduras.
3. Fiebres reumáticas.
4. Rinitis atípicas.
5. Otitis medias.

Respuesta correcta: 1. Caries dentales.